關於放置喉頭罩（laryngeal mask airway）與放置氣管內管（endotracheal tube）的比較，下列敘述何者錯誤？
A. 放置喉頭罩較不具侵入性
B. 放置喉頭罩只需要較淺的麻醉深度
C. 放置喉頭罩可以不須給肌肉鬆弛劑
D. 放置喉頭罩可以避免產生吸入性肺炎的危險性

正確答案：D. 放置喉頭罩可以避免產生吸入性肺炎的危險性